關於卵巢過度刺激症候群（ovarian hyperstimulation syndrome）之敘述，下列何者正確？
A. 注射human chorionic gonadotropin時，血液中的動情素濃度愈高者，愈不會發生卵巢過度刺激症候群
B. 為降低卵巢過度刺激症候群的發生，可考慮將胚胎冷凍
C. 卵巢過度刺激症候群會有腹脹、呼吸困難、腹水等症狀，不會有生命危險
D. 多囊性卵巢婦女較不會產生卵巢過度刺激症候群

正確答案：B. 為降低卵巢過度刺激症候群的發生，可考慮將胚胎冷凍